Clinical trial exclusion criterion:
Indications for concomitant treatment with antiplatelet agents

Annotated entities:
- Drug: "antiplatelet agents"
- Temporal: "concomitant"
- Mood: "Indications"